在檢查某成年男性時，發現其尿液中葡萄糖濃度為 150 mg/mL，而平均尿流量為 1 mL/min，經測量其血中葡萄糖濃度為 500 mg/dL，假設此人的葡萄糖最大轉運量（TmG）為 375 mg/min，則此人的腎小球濾過率（GFR）約為多少mL/min？
A. 125
B. 115
C. 105
D. 95

正確答案：C. 105